Clinical trial inclusion criterion:
Patients volunteered for the study and signed informed consent.

Annotated entities:
- Informed_consent: "Patients volunteered for the study and signed informed consent."